La vacuna DTP inmuniza frente a tres enfermedades:
1. Difteria, tétanos y poliomielitis.
2. Difteria, tosferina y pertussis.
3. Difteria, tétanos y tosferina.
4. Dengue, toxoplasmosis y papilomavirus.

Respuesta correcta: 3. Difteria, tétanos y tosferina.